Clinical trial inclusion criterion:
Adequate family support

Annotated entities:
- Subjective_judgement: "Adequate family support"